Clinical trial exclusion criterion:
Contraindication to Clopidogrel

Annotated entities:
- Drug: "Clopidogrel"
- Condition: "Contraindication"